Clinical trial exclusion criterion:
d. Positive HIV, Hepatitis B, or Hepatitis C test. e. Renal disease or renal dysfunction (as suggested by serum creatinine levels greater than or equal to 1.5 mg/dL (for males) and greater than or equal to 1.4 mg/dL (for females) or abnormal creatinine clearance).

Entity relations:
- Has_value("HIV test", "Positive")
- Has_value("females", "greater than or equal to 1.4 mg/dL")
- Has_value("males", "greater than or equal to 1.5 mg/dL")
- AND("serum creatinine levels", "males")
- Subsumes("Renal disease", "serum creatinine levels")
- OR("HIV test", "Hepatitis B test", "Hepatitis C test")
- OR("males", "females")
- OR("serum creatinine levels", "abnormal creatinine clearance")
- OR("Renal disease", "renal dysfunction")